En un control de tratamiento con Sintrom® se obtuvo un valor de INR (Razón Internacional Normalizada) = 2. Si el tiempo de protrombina control fue de 12 segundos y el ISI (Índice de Sensibilidad Internacional) de 1, ¿cuál fue el tiempo de protrombina del paciente?:
1. 12 segundos.
2. 15 segundos.
3. 24 segundos.
4. 30 segundos.

Respuesta correcta: 3. 24 segundos.